Clinical trial inclusion criteria:
Mexican-american
Female
BMI 30-42
willingness to complete protocol
pre-diabetic
English or Spanish literate

Annotated entities:
- Person: "Mexican-american"
- Person: "Female"
- Measurement: "BMI"
- Value: "30-42"
- Informed_consent: "willingness to complete protocol"
- Condition: "pre-diabetic"
- Non-query-able: "English or Spanish literate"